Age of at least 10 hours

The above is a clinical trial inclusion criterion. Annotated with entity spans:
[Person: Age] of [Value: at least 10 hours]